Clinical trial exclusion criterion:
Previous participation in other clinical trial within 30 days of this study start;

Annotated entities:
- Non-query-able: "Previous participation in other clinical trial within 30 days of this study start;"